Clinical trial exclusion criterion:
Chronic use of any medication, except homeopathy, and trivial ones, as nasal physiologic solution and vitamins;

Annotated entities:
- Multiplier: "Chronic use"
- Drug: "any medication"
- Undefined_semantics: "any medication"
- Procedure: "homeopathy"
- Drug: "nasal physiologic solution"
- Drug: "vitamins"
- Grammar_Error: "and"
- Drug: "trivial ones"
- Undefined_semantics: "trivial ones"
- Subjective_judgement: "trivial ones"
- Negation: "except"